感染岡比亞錐蟲（Trypanosoma gambiense）之晚期，手指壓迫病人之尺神經（ulnar nerve）部位，病人會有感覺遲鈍的現象，此徵候（sign）稱為：
A. Kernig's sign
B. Romaña's sign
C. Winterbottom's sign
D. Kerandel's sign

正確答案：D. Kerandel's sign